2. Researchers think that Patients with disease may be interference results(e.g., Spinal deformity, spine fracture, ankylosing spondylitis, spinal tuberculosis and spinal infection, spinal tumor, pelvic inflammatory disease and other disease of department of gynaecology, etc)

The above is a clinical trial exclusion criterion. Annotated with entity spans:
2. Researchers think that Patients with disease may be interference results(e.g., [Condition: Spinal deformity], [Condition: spine fracture,] [Condition: ankylosing spondylitis], [Condition: spinal tuberculosis] and [Condition: spinal infection], [Condition: spinal tumor], [Condition: pelvic inflammatory disease] and other disease of department of gynaecology, etc)